Subject in a stable heterosexual relationship for at least 6 months. (2)

The above is a clinical trial inclusion criterion. Annotated with entity spans:
Subject in a [Qualifier: stable] [Observation: heterosexual relationship] for [Temporal: at least 6 months]. (2)